Clinical trial exclusion criterion:
A positive pre-study drug/alcohol screen.

Annotated entities:
- Temporal: "pre-study"
- Measurement: "drug screen"
- Measurement: "alcohol screen"
- Value: "positive"